Clinical trial inclusion criterion:
≥ 1 prior regimen (min 2 cycles) with antibody conjugate, cytotoxic chemotherapy, or TKI alone or in combination.

Entity relations:
- Has_multiplier("antibody conjugate", "≥ 1 prior regimen")
- Has_multiplier("≥ 1 prior regimen", "min 2 cycles")
- OR("antibody conjugate", "cytotoxic chemotherapy", "TKI")